Clinical trial exclusion criteria:
Anticoagulant therapy during the past 1 week of the procedure
Known coagulopathy
History of liver cirrhosis, chronic kidney disease, malignancy, inflammatory bowel disease, significant infectious disease, polyposis syndrome

Annotated entities:
- Drug: "Anticoagulant"
- Temporal: "during the past 1 week"
- Procedure: "procedure"
- Reference_point: "procedure"
- Condition: "coagulopathy"
- Condition: "liver cirrhosis"
- Condition: "chronic kidney disease"
- Condition: "malignancy"
- Condition: "inflammatory bowel disease"
- Condition: "significant infectious disease"
- Condition: "polyposis syndrome"
- Temporal: "History"